Clinical trial exclusion criterion:
The diagnosis of developmental delay, attention deficit disorder, chronic pain, psychiatric illness, previous open abdominal surgery, the presence of a gastrostomy, ventricular-peritoneal shunt or other abdominal prosthesis, immunosuppression, and those allergic to any of the medications.

Annotated entities:
- Condition: "developmental delay"
- Condition: "attention deficit disorder"
- Condition: "chronic pain"
- Condition: "psychiatric illness"
- Temporal: "previous"
- Procedure: "open abdominal surgery"
- Device: "gastrostomy"
- Device: "ventricular-peritoneal shunt"
- Device: "abdominal prosthesis"
- Condition: "immunosuppression"
- Condition: "allergic"
- Drug: "any of the medications"